Clinical trial inclusion criterion:
Body Mass Index of 30-40 kg/m2, inclusive. Heterozygous subjects may have a broader BMI range; to be eligible heterozygous subjects may have a BMI 27 -55 kg/ m2, inclusive.

Annotated entities:
- Measurement: "Body Mass Index"
- Value: "30-40 kg/m2, inclusive"
- Condition: "Heterozygous"
- Context_Error: "Heterozygous"
- Condition: "heterozygous"
- Measurement: "BMI"
- Value: "27 -55 kg/ m2, inclusive"
- Parsing_Error: "Heterozygous subjects may have a broader BMI range; to be eligible heterozygous subjects may have a BMI 27 -55 kg/ m2, inclusive."